Clinical trial exclusion criterion:
An initial plasma sodium concentration of lower than 130 mmol/L

Annotated entities:
- Multiplier: "initial"
- Measurement: "plasma sodium concentration"
- Value: "lower than 130 mmol/L"